Additional medication: Use of the following medications within the following time intervals prior to Visit 1 or during the study (unless otherwise specified):

The above is a clinical trial exclusion criterion. Annotated with entity spans:
[Parsing_Error: Additional medication: Use of the following medications within the following time intervals prior to Visit 1 or during the study (unless otherwise specified):]